Clinical trial inclusion criterion:
no previous exposure to etravirine

Annotated entities:
- Drug: "etravirine"
- Negation: "no"
- Temporal: "previous"